Clinical trial exclusion criterion:
Contraindication to enoxaparin

Annotated entities:
- Condition: "Contraindication"
- Drug: "enoxaparin"